有關嬰兒型幽門肥厚狹窄（infantile hypertrophic pyloric stenosis），下列敘述何項錯誤？
A. 均於出生後兩週內發病
B. 吐出物很少膽汁或無膽汁
C. 手術治療為切開幽門括約肌（pyloromyotomy）
D. 手術預後良好

正確答案：A. 均於出生後兩週內發病